Clinical trial exclusion criterion:
No written lC by patient

Annotated entities:
- Informed_consent: "No written lC by patient"